What is inhibited by TH1579?

MTH1